Entre los elementos conceptuales que definen la Atención Primaria de Salud está el concepto de atención integral. ¿Cuál es su significado?
1. Interrelación de promoción, prevención, tratamiento, rehabilitación e inserción social.
2. A lo largo de toda la vida de la persona (desde su nacimiento hasta su muerte).
3. Abordando las esferas física, psíquica y social.
4. Coordinando la atención en consulta y en domicilio, ya sean a demanda o programadas.

Respuesta correcta: 3. Abordando las esferas física, psíquica y social.